Which factors contribute to the risk of very-early-onset inflammatory bowel disease?

Somatic mosaicism and common genetic variation contribute to the risk of very-early-onset inflammatory bowel disease.